Clinical trial exclusion criterion:
Death by excessive bleeding (e.g., abdominal main artery rupture);

Annotated entities:
- Condition: "Death by excessive bleeding"
- Condition: "main artery rupture"
- Qualifier: "abdominal"